Clinical trial inclusion criterion:
Patients undergoing colon resection

Annotated entities:
- Condition: "colon resection"
- Temporal: "undergoing"